Clinical trial inclusion criterion:
Patients with anaemia (males Hb <130 g/L, females <120 g/L) undergoing elective cardiac surgery, and available to receive trial drug 1- 10 weeks prior to surgery

Entity relations:
- Has_value("males", "<130 g/L")
- Has_value("females", "<120 g/L")
- AND("Hb", "males")
- Subsumes("anaemia", "Hb")
- Has_qualifier("cardiac surgery", "elective")
- Has_mood("trial drug", "available to receive")
- Has_temporal("trial drug", "1- 10 weeks prior to surgery")
- Has_index("1- 10 weeks prior to surgery", "surgery")
- multi("surgery", "surgery")
- OR("males", "females")